Clinical trial inclusion criteria:
Male or female
Age 18 to 65 years
Diagnosed with spinal cord injury between 3 days and 4 weeks
American Spinal Injury Association Impairment Scale A or B
Informed consent for inclusion into the database is obtained

Annotated entities:
- Person: "Male"
- Person: "female"
- Person: "Age"
- Value: "18 to 65 years"
- Condition: "spinal cord injury"
- Temporal: "between 3 days and 4 weeks"
- Measurement: "American Spinal Injury Association Impairment Scale"
- Value: "A or B"
- Informed_consent: "Informed consent for inclusion into the database is obtained"